Language barrier.

The above is a clinical trial exclusion criterion. Annotated with entity spans:
[Post-eligibility: Language barrier].